Clinical trial exclusion criterion:
Patients allergic to polyglycolic / trimethylene carbonate

Annotated entities:
- Condition: "allergic"
- Drug: "polyglycolic carbonate"
- Drug: "trimethylene carbonate"